allergy to clostridium histolyticum

The above is a clinical trial exclusion criterion. Annotated with entity spans:
[Condition: allergy] to [Observation: clostridium histolyticum]